seizures or epilepsy in the past

The above is a clinical trial exclusion criterion. Annotated with entity spans:
[Value: seizures] or [Value: epilepsy] [Temporal: in the past]